Clinical trial inclusion criteria:
elective primary total knee arthroplasty
ASA I-III
written consent

Annotated entities:
- Qualifier: "elective"
- Qualifier: "primary"
- Procedure: "total knee arthroplasty"
- Measurement: "ASA"
- Value: "I-III"
- Informed_consent: "written consent"